癌症腫瘤細胞傾向進行無氧呼吸，下列關於無氧呼吸 glucose 代謝的敘述，何者錯誤？
A. 產生 ATP 較少
B. 產生 lactate 較多
C. 產生 acetyl-CoA 較多
D. Krebs cycle 參與的程度較低

正確答案：C. 產生 acetyl-CoA 較多